Clinical trial exclusion criterion:
Life expectancy less than 1year

Annotated entities:
- Observation: "Life expectancy"
- Value: "less than 1year"